Clinical trial exclusion criterion:
Uncontrolled Heart Failure or NYHA Class III or IV heart failure

Annotated entities:
- Condition: "Heart Failure"
- Qualifier: "Uncontrolled"
- Condition: "heart failure"
- Qualifier: "NYHA Class III"
- Qualifier: "NYHA Class IV"